La DNA fotoliasa:
1. Repara los dímeros de ciclobutano pirimidina en presencia de luz visible.
2. Se une al DNA específicamente en los dímeros de purina.
3. Contiene tres cromóforos.
4. Está presente en todas las células eucariotas.
5. Rompe los enlaces que ligan anillos de pirimidinas y después se disocia en presencia de luz visible.

Respuesta correcta: 1. Repara los dímeros de ciclobutano pirimidina en presencia de luz visible.